La valoración potenciométrica de cloruro con un electrodo de plata, empleando una disolución patrón de ion plata:
1. Se basa en la formación de complejos de plata en presencia de una elevada concentración de cloruro.
2. Sigue la ecuación de Nernst, en que la variación del potencial varía linealmente con la concentración de ion plata.
3. Muestra un punto de equivalencia en el que pAg no depende de la concentración de cloruro.
4. Da lugar a variaciones de potencial que dependen de la cantidad de AgCl formado.
5. Proporciona una curva de valoración en la que el salto de pAg no depende de la concentración de cloruro.

Respuesta correcta: 3. Muestra un punto de equivalencia en el que pAg no depende de la concentración de cloruro.